微生物引起的飲食疾病，細菌性占大部分，其中發病較快的是屬於下列那一類型？
A. 細菌毒素早已存在食物中致病
B. 細菌感染繁殖致病
C. 細菌毒素於感染過程形成而致病
D. 細菌感染突變致病

正確答案：A. 細菌毒素早已存在食物中致病